Clinical trial inclusion criterion:
1. Have a finding of a mass lesion on mammography or breast MRI (BIRADS 0, 4 or 5) that is >0.5 cm and < 2 cm in size and has had or will have additional workup with focused ultrasound.

Entity relations:
- Has_value("BIRADS", "0, 4 or 5")
- Has_value("size", ">0.5 cm and < 2 cm")
- AND("mass lesion", "size")
- AND("breast MRI", "BIRADS")
- AND("mass lesion", "mammography")
- OR("mammography", "breast MRI")